Clinical trial inclusion criterion:
for women of childbearing potential no negative pregnancy test and no agree to use reliable method of birth control during the study

Annotated entities:
- Pregnancy_considerations: "for women of childbearing potential no negative pregnancy test and no agree to use reliable method of birth control during the study"